List anti-amyloid-beta monoclonal antibodies that have been investigated in clinical trials for treatment of Alzheimer disease.

Ponezumab, solanezumab and bapineuzumab are humanized antiamyloid beta (Aβ) monoclonal antibodies that have been designed for treatment of Alzheimer disease.